下列何種ATPase負責維持哺乳類動物體中最大的離子濃度梯度（gradient）？
A. 鈉離子-鉀離子三磷酸腺苷酶（Na+-K+ ATPase）
B. 紅血球陰離子運輸器（anion transporter）
C. 氫離子-鉀離子三磷酸腺苷酶（H+-K+ ATPase）
D. 鈣離子三磷酸腺苷酶（Ca2+ATPase）

正確答案：C. 氫離子-鉀離子三磷酸腺苷酶（H+-K+ ATPase）